What receptor is associated with the protein encoded by the Spätzle gene?

Currently, as a ligand for the Toll-1 receptor, only Spatzle (Spz) has been identified and characterized.